Clinical trial exclusion criterion:
Ongoing need for psychoactive medication other than study medication [excepting stable doses (greater than three months duration) of anticonvulsant medication for seizure disorder, or diphenhydramine (Benadryl®)for sleep]

Entity relations:
- AND("anticonvulsant medication", "seizure disorder")
- Has_temporal("stable doses", "greater than three months")
- AND("anticonvulsant medication", "stable doses")
- Has_negation("study medication", "other than")
- AND("psychoactive medication", "study medication")
- Has_negation("anticonvulsant medication", "excepting")
- AND("psychoactive medication", "anticonvulsant medication")
- OR("anticonvulsant medication", "diphenhydramine")